Clinical trial inclusion criteria:
HCV RNA evidence of HCV infection
Documented history of chronic HCV RNA infection with Genotype 1
Able to provide informed consent
Available for ongoing follow-up if required

Annotated entities:
- Measurement: "HCV RNA"
- Condition: "HCV infection"
- Condition: "chronic HCV infection"
- Qualifier: "Genotype 1"
- Informed_consent: "Able to provide informed consent"
- Post-eligibility: "Available for ongoing follow-up if required"